During which stage of the cell cycle is cohesin deposited on the yeast genome?

In the budding yeast, cohesin is loaded onto the chromosome during the late G1 phase, establishes sister chromatid cohesion concomitant with DNA replication, and dissociates by the telophase.